Clinical trial exclusion criterion:
Underlying medical condition with survival unlikely during follow-up period

Annotated entities:
- Condition: "medical condition"
- Condition: "survival unlikely"